Clinical trial exclusion criterion:
Erectile dysfunction in the history or current medication for erectile dysfunction

Entity relations:
- Has_temporal("Erectile dysfunction", "history")
- Has_temporal("medication", "current")
- AND("medication", "erectile dysfunction")
- OR("Erectile dysfunction", "medication")